periodontal treatment in the last year (before baseline appointment)

The above is a clinical trial exclusion criterion. Annotated with entity spans:
[Procedure: periodontal treatment] [Temporal: in the last year] ([Temporal: before baseline appointment])